Patient with significant polymicrobial bacteraemia (that is, a Gram positive skin contaminant in one set of blood cultures is not regarded as significant polymicrobial bacteraemia).

The above is a clinical trial exclusion criterion. Annotated with entity spans:
Patient with significant [Qualifier: polymicrobial] [Condition: bacteraemia] (that is, a Gram positive skin contaminant in one set of blood cultures is not regarded as significant polymicrobial bacteraemia).